Clinical trial exclusion criterion:
Active infection in the anal fistula

Annotated entities:
- Condition: "anal fistula"
- Condition: "infection in the anal fistula"